Clinical trial inclusion criteria:
BMI = 35
type 2 diabetes
HbA1c = 6,5 % or fasting glycemia =7mmol/l or non-fasting glycemia =11mmol/l
able to consent

Annotated entities:
- Measurement: "BMI"
- Value: "= 35"
- Condition: "type 2 diabetes"
- Measurement: "HbA1c"
- Value: "= 6,5 %"
- Measurement: "fasting glycemia"
- Value: "=7mmol/l"
- Measurement: "non-fasting glycemia"
- Value: "=11mmol/l"
- Informed_consent: "able to consent"